一位 5 歲大的男孩被發現有持續 2 週的右側腋窩淋巴腺腫脹，腫脹的淋巴腺只有輕微壓痛，且無明顯發燒病史。病患的右手臂上有被抓傷的痕跡，病患無結核病家族史或接觸史，皮膚結核菌素測驗為陰性反應。此童的淋巴腺病理切片以那一種染色方法，最有可能看到病原體？
A. 抗酸性染色法（acid-fast stain）
B. 格蘭氏染色法（Gram stain）
C. 印度墨汁染色法（India ink）
D. Warthin-Starry stain

正確答案：D. Warthin-Starry stain